The virus that causes FIP, Feline Infectious Peritonitis belongs to what family?

Feline infectious peritonitis (FIP) is a cat virus caused by a member of the coronavirus family coronaviruses.